一位 32 歲男性上班途中，迎面與另一部小客車撞擊，送到醫院發現右下肢稍微移動就非常疼痛，腳部呈現外翻的姿勢，理學檢查並沒有發現有神經、血管損傷的跡象，X 光檢查發現右髖關節沒有脫臼，但是股骨頸有骨折並且移位，請問下列何者為最適當的處置方式？
A. 先安排住院給予骨骼牽引，以進一步觀察其他潛藏的併發症
B. 立刻打止痛針，並且在急診將骨折復位，以免發生股骨頭壞死
C. 立即評估麻醉風險，儘速安排手術將骨折固定
D. 骨折已移位，向病人詳細解釋，並且安排接受人工關節置換

正確答案：C. 立即評估麻醉風險，儘速安排手術將骨折固定